Clinical trial exclusion criterion:
(i) influenza vaccination, which may be received at least 2 weeks before study vaccines.

Annotated entities:
- Drug: "influenza vaccination"
- Temporal: "at least 2 weeks before study vaccines"
- Reference_point: "study vaccines"